Clinical trial exclusion criterion:
Malabsorption syndrome or other condition that precludes enteral route of administration

Annotated entities:
- Condition: "Malabsorption syndrome"
- Condition: "condition that precludes enteral route of administration"
- Undefined_semantics: "condition that precludes enteral route of administration"